3. Right heart catheterization performed at Screening with results that are:

The above is a clinical trial inclusion criterion. Annotated with entity spans:
[Parsing_Error: 3.] [Parsing_Error: Right heart catheterization performed at Screening with results that are:]